Clinical trial exclusion criterion:
Dementia.

Annotated entities:
- Condition: "Dementia"